Clinical trial exclusion criterion:
History of latex allergy

Entity relations:
- AND("allergy", "latex")
- Has_temporal("allergy", "History")